Clinical trial exclusion criterion:
Drug or alcohol dependence within 1 year

Annotated entities:
- Condition: "alcohol dependence"
- Condition: "Drug dependence"
- Temporal: "within 1 year"